Clinical trial exclusion criterion:
Addition of trocar(s) or conversion of surgery to hand-assisted or open

Annotated entities:
- Drug: "trocar"
- Observation: "conversion of surgery"
- Procedure: "hand-assisted"
- Procedure: "open"
- Procedure: "surgery"
- Mood: "Addition of"